一名 28 歲男性，例行性健康檢查時，被告知在肝臟有一個腫瘤。他的肝功能正常，且也未有肝炎病毒感染的病史。腹部電腦斷層檢查顯示，肝臟右葉被膜下有一個界限清楚 3 公分大的腫瘤，腫瘤中央有一個明顯星狀的纖維化區域存在。肝臟其他部分正常並未有肝硬化現象。下列何者是最可能的診斷？
A. 肝腺瘤（hepatic adenoma）
B. 局部結節狀增生（focal nodular hyperplasia）
C. 肝細胞癌（hepatocellular carcinoma）
D. 肝母細胞瘤（hepatoblastoma）

正確答案：B. 局部結節狀增生（focal nodular hyperplasia）